Clinical trial exclusion criterion:
6. Use of systemic steroids within 1 month of study entry

Annotated entities:
- Drug: "systemic steroids"
- Temporal: "within 1 month of study entry"
- Reference_point: "study entry"